Clinical trial exclusion criterion:
Patients deprived of their civic rights, in custody, or subject to a tutorial, judiciary or administrative decision.

Entity relations:
- OR("deprived of their civic rights", "in custody", "subject to a tutorial", "subject to a judiciary decision", "subject to administrative decision")